History of suicidal behavior or suicidal ideation as indicated by the C-SSRS, administered at screening (the questionnaire is provided in Appendix 4), and as per investigator's judgment.

The above is a clinical trial exclusion criterion. Annotated with entity spans:
History of [Observation: suicidal behavior] or [Condition: suicidal ideation] as indicated by the C-SSRS, administered at screening (the questionnaire is provided in Appendix 4), and as per investigator's judgment.